Clinical trial inclusion criterion:
3. During the course of the study, from study screen until study exit - including the washout period, women of childbearing potential must use a spermicide containing barrier method of contraception in addition to their current contraceptive device. This advice should be documented in the informed consent form.

Annotated entities:
- Person: "women"
- Condition: "childbearing potential"
- Procedure: "spermicide containing barrier method of contraception"
- Multiplier: "in addition to"
- Temporal: "current"
- Device: "contraceptive device"
- Temporal: "During the course of the study"